Clinical trial inclusion criterion:
18-80 year, male or female.

Annotated entities:
- Person: "year"
- Value: "18-80"
- Person: "male"
- Person: "female"